Clinical trial exclusion criterion:
Women with breast implants on the same side as the lesion

Entity relations:
- Has_index("same side as the lesion", "the lesion")
- Has_qualifier("breast implants", "same side as the lesion")